對於頭部外傷的病人，下列何種方法降低腦壓的效果最差？
A. 頭抬高30度
B. 使用mannitol或glycerol等藥物
C. hypoventilation
D. craniectomy

正確答案：C. hypoventilation